Clinical trial inclusion criterion:
Imaging evidence of new or presumed new loss of viable myocardium or regional wall motion abnormality.

Annotated entities:
- Procedure: "Imaging"
- Condition: "evidence"
- Multiplier: "presumed new"
- Multiplier: "new"
- Condition: "loss of viable myocardium"
- Condition: "regional wall motion abnormality"